¿Qué es la onicomicosis?:
1. Una infección de la mucosa oral y encías de lactantes producida por Candida albicans.
2. Un absceso cerebral en inmunodeprimidos causado por Aspergillus spp.
3. Una infección de las uñas por hongos dermatofitos.
4. Una variedad grave de acné en el que participan también especies fúngicas.
5. Una infección pulmonar causada por Pneumocystis jirovecii.

Respuesta correcta: 3. Una infección de las uñas por hongos dermatofitos.